Agreement to the trial protocol, including the randomized manner

The above is a clinical trial inclusion criterion. Annotated with entity spans:
[Observation: Agreement to the trial protocol], including the randomized manner